What are the names of anti-CD52 monoclonal antibody that is used for treatment of multiple sclerosis patients?

Alemtuzumab and Campath-1H are the names of anti-CD52 monoclonal antibody that is used for treatment of multiple sclerosis patients. It has been shown to be effective for treatment naive and treatment resistant multiple sclerosis patients.